Meet one or more of the contraindications for MRI including Psychiatric disorders, anxiety, claustrophobia Cardiac disorders that represent a contraindication to MRI

The above is a clinical trial exclusion criterion. Annotated with entity spans:
Meet [Multiplier: one or more] of the [Condition: contraindications] for [Procedure: MRI] including [Condition: Psychiatric disorders], [Condition: anxiety], [Condition: claustrophobia] [Condition: Cardiac disorders] that represent a [Condition: contraindication] to [Procedure: MRI]